chronic otitis

The above is a clinical trial exclusion criterion. Annotated with entity spans:
[Condition: chronic otitis]